Clinical trial exclusion criterion:
Previous treatment with the ketogenic diet

Entity relations:
- Has_qualifier("ketogenic diet", "Previous")